Clinical trial exclusion criterion:
14. Statins: simvastatin, fluvastatin, rosuvastatin at doses greater than 10 mg/d, atorvastatin at doses greater than 10 mg/d.

Annotated entities:
- Parsing_Error: "14."
- Multiplier: "doses greater than 10 mg/d"
- Drug: "simvastatin"
- Drug: "fluvastatin"
- Drug: "rosuvastatin"
- Drug: "atorvastatin"
- Multiplier: "doses greater than 10 mg/d"